Type 2 diabetic inpatient

The above is a clinical trial inclusion criterion. Annotated with entity spans:
[Condition: Type 2 diabetic] [Visit: inpatient]